El síndrome de respuesta inflamatoria sistémica (SIRS) se caracteriza por los siguientes criterios clínicos, EXCEPTO uno de ellos, señálelo:
1. Temperatura > 38ºC o < 36ºC.
2. Bradicardia < 60 latidos por minuto.
3. Taquipnea > 20 respiraciones por minuto (o pCO2 <32 mmHg).
4. Leucocitos >12.000 o <4.000 (o más del 10% de formas leucocitarias inmaduras en sangre).

Respuesta correcta: 2. Bradicardia < 60 latidos por minuto.